Clinical trial inclusion criterion:
Clinically suspected scrub typhus: defined as acute undifferentiated fever with no clear focus of infection and negative malaria blood smear and/or negative malaria RDT. Patients may have one, none, or a combination of other clinical findings such as eschar, rash, lymphadenopathy, headache, myalgia, cough, nausea and abdominal discomfort.

Annotated entities:
- Condition: "scrub typhus"
- Condition: "acute undifferentiated fever"
- Condition: "focus of infection"
- Negation: "no clear"
- Value: "negative"
- Measurement: "malaria blood smear"
- Value: "negative"
- Measurement: "malaria RDT"
- Multiplier: "one"
- Multiplier: "none"
- Multiplier: "a combination of"
- Condition: "eschar"
- Condition: "rash"
- Condition: "lymphadenopathy"
- Condition: "headache"
- Condition: "myalgia"
- Condition: "cough"
- Condition: "nausea"
- Condition: "abdominal discomfort"